Clinical trial inclusion criterion:
patients classified with American Society of Anesthesiologists Physical Status Classification System as 1 or 2 status

Entity relations:
- Has_value("status American Society of Anesthesiologists Physical Status Classification System", "1 or 2")